Clinical trial exclusion criteria:
Known or suspected serious spinal pathology and spinal implants
Lumbar spinal surgery within the preceding six months
Serious comorbidities preventing prescription of paracetamol
Alternative treatment for low back pain in previous two weeks
Chronic neurological lesion
Chronic musculoskeletal lesion
Active cancer
Pregnancy
Use of pain medication (except paracetamol) within 3 days
Treatment site has active skin lesion or inflammation
Known allergy to skin patch

Annotated entities:
- Condition: "spinal pathology"
- Device: "spinal implants"
- Qualifier: "serious"
- Mood: "suspected"
- Mood: "Known"
- Mood: "Known or suspected"
- Procedure: "Lumbar spinal surgery"
- Temporal: "within the preceding six months"
- Qualifier: "Serious"
- Condition: "comorbidities"
- Condition: "preventing"
- Drug: "paracetamol"
- Qualifier: "Alternative"
- Procedure: "treatment"
- Condition: "low back pain"
- Temporal: "in previous two weeks"
- Condition: "Chronic neurological lesion"
- Condition: "Chronic musculoskeletal lesion"
- Condition: "cancer"
- Qualifier: "Active"
- Condition: "Pregnancy"
- Drug: "pain medication"
- Negation: "except"
- Drug: "paracetamol"
- Temporal: "within 3 days"
- Condition: "skin lesion"
- Condition: "inflammation"
- Qualifier: "active"
- Condition: "allergy"
- Device: "skin patch"